Clinical trial exclusion criteria:
OAT required for reasons not related to AF (i.e., prosthetic valve, PV stenosis, previous pulmonary embolism, presence of spontaneous echo contrast [SEC] at standard echo performed at 3-months follow-up).
Any cardiac surgery within the past 60 days (2 months) or valvular cardiac surgical procedure at any time (i.e., ventriculotomy, atriotomy, and valve repair or replacement and presence of a prosthetic valve)
Previous myocardial infarction (MI) or a percutaneous coronary intervention PCI within the past 3 months
Awaiting cardiac transplantation or other cardiac surgery within the next 365 days (12 months)
Documented left atrial thrombus
Significant pulmonary disease, (e.g., restrictive pulmonary disease, constrictive or COPD) or any other disease or malfunction of the lungs or respiratory system that produces chronic symptoms
Significant medical problem that in the opinion of the investigator would preclude enrollment in this study
Women who are pregnant (as evidenced by pregnancy test if pre-menopausal)
Acute illness or active systemic infection or sepsis
Unstable angina
Contraindication to anticoagulation (i.e., heparin, warfarin or another commercially available anticoagulation medication)
History of blood clotting or bleeding abnormalities
Life expectancy less than 360 days (12 months)
Uncontrolled Heart Failure or NYHA Class III or IV heart failure
Enrollment in a clinical study evaluating another device or drug, within the past 6 months
Unable or unwilling to comply with protocol requirements

Annotated entities:
- Drug: "OAT"
- Negation: "not"
- Qualifier: "AF"
- Device: "prosthetic valve"
- Condition: "PV stenosis"
- Condition: "pulmonary embolism"
- Measurement: "standard echo"
- Temporal: "3-months follow-up"
- Reference_point: "follow-up"
- Value: "spontaneous echo contrast"
- Value: "SEC"
- Procedure: "cardiac surgery"
- Temporal: "within the past 60 days"
- Temporal: "2 months"
- Procedure: "valvular cardiac surgical"
- Procedure: "ventriculotomy"
- Procedure: "atriotomy"
- Procedure: "valve repair"
- Procedure: "valve replacement"
- Device: "prosthetic valve)"
- Condition: "myocardial infarction"
- Condition: "MI"
- Procedure: "percutaneous coronary intervention"
- Procedure: "PCI"
- Temporal: "within the past 3 months"
- Procedure: "cardiac transplantation"
- Mood: "Awaiting"
- Procedure: "cardiac surgery"
- Temporal: "within the next 365 days"
- Temporal: "within 12 months"
- Condition: "left atrial thrombus"
- Condition: "pulmonary disease"
- Qualifier: "Significant"
- Condition: "restrictive pulmonary disease"
- Condition: "COPD"
- Non-query-able: "any other disease or malfunction of the lungs or respiratory system that produces chronic symptoms"
- Non-query-able: "ignificant medical problem that in the opinion of the investigator would preclude enrollment in this study"
- Pregnancy_considerations: "Women who are pregnant (as evidenced by pregnancy test if pre-menopausal)"
- Condition: "systemic infection"
- Condition: "sepsis"
- Non-query-able: "Acute illness"
- Condition: "Unstable angina"
- Condition: "Contraindication"
- Drug: "anticoagulation"
- Drug: "heparin"
- Drug: "warfarin"
- Non-query-able: "nother commercially available anticoagulation medication"
- Condition: "bleeding abnormalities"
- Condition: "blood clotting abnormalities"
- Observation: "Life expectancy"
- Value: "less than 360 days"
- Value: "less than 12 months"
- Condition: "Heart Failure"
- Qualifier: "Uncontrolled"
- Condition: "heart failure"
- Qualifier: "NYHA Class III"
- Qualifier: "NYHA Class IV"
- Competing_trial: "Enrollment in a clinical study evaluating another device or drug, within the past 6 months"
- Post-eligibility: "Unable or unwilling to comply with protocol requirements"